Coexisting causes of chronic liver disease - chronic viral hepatitis(B & C), autoimmune liver disease, hemochromatosis, Wilson's etc.

The above is a clinical trial exclusion criterion. Annotated with entity spans:
Coexisting causes of [Condition: chronic liver disease] - [Condition: chronic viral hepatitis](B [Parsing_Error: &] C), [Condition: autoimmune liver disease], [Condition: hemochromatosis], [Condition: Wilson's] etc.